Known hypersensitivity to egg, soybean proteins, peanut proteins, corn or corn products, or to any of the active substances or excipients

The above is a clinical trial exclusion criterion. Annotated with entity spans:
Known [Condition: hypersensitivity] to [Drug: egg], [Drug: soybean proteins], [Drug: peanut proteins], [Drug: corn] or [Drug: corn products], or to any of the [Drug: active substances] or [Drug: excipients]